Clinical trial inclusion criterion:
able to walk independently for 30 metres with or without an assistive device.

Entity relations:
- Has_multiplier("able to walk independently with or without an assistive device", "for 30 metres")